Clinical trial exclusion criterion:
The patient does not require treatment with aspirin or any other antiplatelet agent

Entity relations:
- Has_qualifier("antiplatelet agent", "other")
- AND("treatment", "aspirin")
- Has_mood("treatment", "require")
- Has_negation("require", "not")
- OR("aspirin", "antiplatelet agent")